Clinical trial inclusion criterion:
failure of current antiretroviral regimen due to:

Annotated entities:
- Procedure: "antiretroviral regimen"
- Condition: "failure of current antiretroviral regimen"
- Temporal: "current"